Clinical trial inclusion criterion:
35-75 years old;

Annotated entities:
- Value: "35-75 years old"
- Person: "old"